Un paciente con insuficiencia renal crónica tiene que seguir una dieta controlada en potasio. ¿Qué alimentos debe suprimir para reducir la ingestión de potasio?:
1. Azúcares.
2. Pescados.
3. Fruta en compota.
4. Verduras crudas.
5. Néctar de frutas.

Respuesta correcta: 4. Verduras crudas.